組胺酸（histidine）有三個酸解離常數（pKa）值，分別為1.82、 6.0、 9.17。其中那個官能基團的pKa為1.82 ？
A. 胺基（-NH3+）
B. 羧基（-COOH）
C. 側鏈異吡唑基（side-chain imidazole group）
D. α碳原子（α carbon）的氫原子

正確答案：B. 羧基（-COOH）